Anemia (hematocrit < 34%) as measured at screening visit

The above is a clinical trial exclusion criterion. Annotated with entity spans:
[Condition: Anemia] ([Measurement: hematocrit] [Value: < 34%]) as measured at [Visit: screening visit]